Amino group 可藉由下列何種方式，由骨骼肌細胞運送到肝細胞代謝？
A. Krebs cycle
B. Glucose-alanine cycle
C. Urea cycle
D. Citric acid cycle

正確答案：B. Glucose-alanine cycle